1. patient refusal

The above is a clinical trial exclusion criterion. Annotated with entity spans:
[Non-query-able: 1. patient refusal]